42歲的男性，過去身體都十分健康，也沒有任何全身性疾病。此次因為罹患A型流行性感冒後，併發細菌性肺炎。其最可能的致病菌為何？
A. 肺炎鏈球菌（Streptococcus pneumoniae）或金黃色葡萄球菌（Staphylococcus aureus）
B. 綠膿桿菌（Pseudomonas aeruginosa）或克雷氏桿菌（Klebsiella pneumoniae）
C. 黴漿菌（Mycoplasma pneumoniae）
D. 厭氧性細菌

正確答案：A. 肺炎鏈球菌（Streptococcus pneumoniae）或金黃色葡萄球菌（Staphylococcus aureus）